婦女尿失禁最常見的原因是下列那一項？
A. Detrusor dyssynergia
B. Unstable urethra
C. Unstable bladder
D. Urethral diverticulum

正確答案：C. Unstable bladder